Name a method for enrichment of arginine-methylated peptides.

Immunoaffinity purification using specific antibodies has been used in order to perform enrichment of methylated peptides.